人體內，vitamin D3轉為25-hydroxycholecalciferol主要是在下列何種器官中進行？
A. skin
B. kidney
C. liver
D. parathyroid gland

正確答案：C. liver